Metastatic invasive hormone receptor positive and HER2 negative breast cancer (histologically confirmed).

The above is a clinical trial inclusion criterion. Annotated with entity spans:
[Qualifier: Metastatic] [Qualifier: invasive] [Qualifier: hormone receptor positive] and [Qualifier: HER2 negative] [Condition: breast cancer] ([Non-query-able: histologically confirmed]).